Clinical trial inclusion criterion:
4. Healthy and self-reported sexually active

Annotated entities:
- Condition: "Healthy"
- Condition: "sexually active"
- Observation: "self-reported"
- Qualifier: "self-reported"